Clinical trial exclusion criterion:
With acute myocardial infarction with ST segment elevation in the first 12 hours from the onset of symptoms.

Annotated entities:
- Condition: "acute myocardial infarction"
- Condition: "ST segment elevation"
- Temporal: "in the first 12 hours from the onset of symptoms"
- Reference_point: "the onset of symptoms"